12. Hypersensitivity to caffeine, warfarin, vitamin K, omeprazole, dextromethorphan, midazolam, tipranavir, ritonavir or their excipients

The above is a clinical trial exclusion criterion. Annotated with entity spans:
[Parsing_Error: 12.] [Condition: Hypersensitivity] to [Drug: caffeine], [Drug: warfarin], [Drug: vitamin K], [Drug: omeprazole], [Drug: dextromethorphan], [Drug: midazolam], [Drug: tipranavir], [Drug: ritonavir] or their excipients